采采蠅（tse-tse fly）可以媒介下列何種寄生蟲病？
A. 黑熱病（kala azar）
B. 睡眠病（sleeping sickness）
C. 查加斯氏病（Chagas' disease）
D. 利什曼症（Leishmaniasis）

正確答案：B. 睡眠病（sleeping sickness）